Subjects must have received no more than 2 prior systemic therapies for lymphoma. Prior therapy with systemic rituximab monotherapy or conventional chemotherapy (i.e. bendamustine, CVP (Cyclophosphamide, Vincristine Sulfate, Prednisone) or other) ± rituximab for indolent non-Hodgkin's lymphoma (NHL) ± maintenance/extended-use rituximab will count as 1 line of systemic therapy.

The above is a clinical trial inclusion criterion. Annotated with entity spans:
Subjects must have received [Multiplier: no more than 2] [Temporal: prior] [Procedure: systemic therapies for lymphoma]. [Temporal: Prior] therapy with [Procedure: systemic] [Drug: rituximab] monotherapy or [Procedure: conventional chemotherapy] (i.e. [Drug: bendamustine], [Drug: CVP] ([Drug: Cyclophosphamide], [Drug: Vincristine Sulfate], [Drug: Prednisone]) or other) ± [Drug: rituximab] for [Qualifier: indolent] [Condition: non-Hodgkin's lymphoma (NHL)] ± [Qualifier: maintenance]/[Qualifier: extended-use] [Drug: rituximab] will count as 1 line of systemic therapy.